下列有關腫瘤生長之敘述，何者正確？
A. 腫瘤細胞的生長分數（growth fraction）與它的化療受性無關
B. 臨床上發現腫瘤時，它的細胞大部分在繁殖期
C. 腫瘤細胞大部分都有較短的細胞週期
D. 腫瘤愈長愈大是因為細胞的增生超越細胞的損失

正確答案：D. 腫瘤愈長愈大是因為細胞的增生超越細胞的損失